Clinical trial exclusion criterion:
Allergy or contraindication to paracetamol, Prasugrel or Ticagrelor

Entity relations:
- AND("Allergy", "paracetamol")
- OR("paracetamol", "Ticagrelor", "Prasugrel")
- OR("Allergy", "contraindication")